Other indication for intrapartum antibiotics (endocarditis prophylaxis, other known maternal infection)

The above is a clinical trial exclusion criterion. Annotated with entity spans:
Other [Condition: indication] for [Drug: intrapartum antibiotics] ([Condition: endocarditis prophylaxis], other known [Condition: maternal infection])